有關長鏈（long-chain）、中鏈（medium-chain）和短鏈（short-chain）脂肪酸（fatty acid）之敘述，何者正確？
A. 食物中主要含短鏈脂肪酸
B. 長鏈脂肪酸主要在大腸吸收
C. 短鏈脂肪酸不會出現於糞便當中
D. 中鏈脂肪酸的吸收，不需要胰臟的脂解作用（pancreatic lipolysis）

正確答案：D. 中鏈脂肪酸的吸收，不需要胰臟的脂解作用（pancreatic lipolysis）